26 歲女性無故暈倒而被送至急診室，理學檢查發現血壓 220/110 mmHg，心跳 130 次/分鐘，臉部潮 紅，則要安排下列那些檢查？①complete blood count（CBC） ②total urine VMA level ③blood free catecholamines ④total urine free catecholamines ⑤abdominal CT scan
A. ①②③
B. ②③⑤
C. ①④⑤
D. ②④⑤

正確答案：D. ②④⑤